¿En cuál de las siguientes reacciones del ciclo del ácido cítrico se produce la incorporación neta de los elementos del agua a un intermediario del ciclo?:
1. Succinil-CoA sintasa.
2. Succinato deshidrogenasa.
3. Aconitasa.
4. Citrato sintasa.

Respuesta correcta: 4. Citrato sintasa.